正常人呼吸時，下列何者測得的壓力於吸氣期和呼氣期最可能都是負壓（negative pressure）？
A. 肋膜內壓（intrapleural pressure）
B. 肺泡壓（alveolar pressure）
C. 肺泡壓－肋膜壓（transpulmonary pressure）
D. 氣道壓（airway pressure）

正確答案：A. 肋膜內壓（intrapleural pressure）